Age 19 years of older

The above is a clinical trial inclusion criterion. Annotated with entity spans:
[Person: Age] [Value: 19 years of older]